C. N. tiene un importante sobrepeso, no puede resistirse y come a cualquier hora. Comenta a la enfermera que no puede controlar sus acciones y que tiene muy mala suerte con el problema de la comida. Esta señora presenta un estilo atribucional:
1. De indefensión.
2. Interno.
3. Externo.
4. Neurótico.
5. Asertivo.

Respuesta correcta: 3. Externo.